All patients must be prohibited donation during the treatment process and in 28 days after treatment;

The above is a clinical trial inclusion criterion. Annotated with entity spans:
All patients must be [Negation: prohibited] [Procedure: donation] [Temporal: during the treatment process] and [Temporal: in 28 days after treatmen]t;